Las anorexias nerviosas suelen ir acompañadas de una amenorrea por desnutrición que puede ser primaria o secundaria y que tiene un origen:
1. Ovárico.
2. Uterino.
3. Hipofisario.
4. Hipotalámico.

Respuesta correcta: 4. Hipotalámico.